Clinical trial exclusion criterion:
Any condition/illness that may affect the study outcomes or would make participation potentially harmful such as pregnancy or breastfeeding, diabetes mellitus, heart disease, stroke, hypertension, malabsorption syndromes, GERD, a history of ulcer, according to a detailed medical history.

Entity relations:
- AND("history of", "ulcer")
- Subsumes("illness that may affect the study outcomes", "pregnancy")
- Has_temporal("pregnancy", "medical history")
- Has_temporal("history of", "medical history")
- OR("illness that may affect the study outcomes", "illness that would make participation potentially harmful")
- OR("pregnancy", "breastfeeding", "diabetes mellitus", "heart disease", "stroke", "hypertension", "malabsorption syndromes", "GERD", "ulcer")